Clinical trial exclusion criterion:
Health condition considered unsafe for inclusion (at discretion of PI and/or attending physician)

Entity relations:
- Has_qualifier("Health condition", "considered unsafe for inclusion")